Clinical trial inclusion criterion:
All patients will be undergoing a primary unilateral total knee arthroplasty for a diagnosis of osteoarthritis

Entity relations:
- AND("unilateral total knee arthroplasty", "osteoarthritis")
- Has_qualifier("unilateral total knee arthroplasty", "primary")